下列何種免疫調節藥物可以增加肉芽腫病患者體內巨噬細胞之吞噬作用？
A. Prednisone
B. Interferon-γ
C. Transtuzumab
D. Aldesleukin

正確答案：B. Interferon-γ